Presence of active or acute AIDS-defining opportunistic infections within 12 weeks prior to study entry.

The above is a clinical trial exclusion criterion. Annotated with entity spans:
Presence of [Temporal: active] or [Temporal: acute] [Condition: AIDS-defining opportunistic infections] [Temporal: within 12 weeks prior to study entry].